1. Orthopedic injuries that are unstable

The above is a clinical trial exclusion criterion. Annotated with entity spans:
[Parsing_Error: 1.] [Condition: Orthopedic injuries] that are [Qualifier: unstable]